Clinical trial exclusion criterion:
Body Mass Index (BMI) > 50

Annotated entities:
- Measurement: "Body Mass Index (BMI)"
- Value: "> 50"